Clinical trial exclusion criterion:
Hemoglobin <9 g/dL

Annotated entities:
- Measurement: "Hemoglobin"
- Value: "<9 g/dL"